Please list 6 symptoms of Scarlet fever.

Symptoms of scarlet fever include fever, rash, strawberry tongue and sore throat. In some cases other symptoms, angular stomatitis, tonsular exudate, and swollen lymph nodes are seen.